Clinical trial exclusion criterion:
Use of prescribed stimulants (such as amphetamine or dextroamphetamine containing medications) is exclusionary in the 2 weeks prior to the initial screen (P1) visit and prohibited throughout the study. Participants who take these medications will be asked to discontinue them for a minimum of 2 weeks before the Preliminary Screening Period.

Annotated entities:
- Drug: "prescribed stimulants"
- Drug: "amphetamine"
- Drug: "dextroamphetamine"
- Temporal: "in the 2 weeks prior to the initial screen (P1) visit"